Clinical trial exclusion criteria:
Non-compliance with DOTPlus. Alternatively DOT can be done by telephoning patient on a daily basis 5 times a week and having patient annotate taking drug in a log which would be reviewed by clinic staff
History of being treated for tuberculosis in the prior 2 years unless there is DST, including PCR testing, showing sensitivity to rifamycin.
Known hypersensitivity to rifampin or rifabutin.
Liver enzymes greater than 2 times ULN.
Bilirubin greater than 2 times ULN.
Serum creatinine greater than 3 times ULN.
Hemoglobin less than 7.0 gms even if receiving erythropoietin.
Absolute neutrophil count less than 750 cells/mm3 even if receiving G-CSF.
Fasting triglycerides greater than 400 mg/dL.
Fasting cholesterol > 1.6 upper limits of normal.
GI intolerance of tuberculosis medications requiring discontinuation of tuberculosis medications.
Fasting glucose greater 150 mg/dL.
Pregnant women.
Use of one of the prohibited medications
Any condition that the investigators feel could compromise the use of the current medication.
Have a CD4 cell count of 50 cells/mm3or less
Hepatitis B or C infection
Alcohol or illicit drug use, which in the investigators opinion may affect participation in study.

Annotated entities:
- Condition: "Non-compliance"
- Procedure: "DOTPlus"
- Non-query-able: "Alternatively DOT can be done by telephoning patient on a daily basis 5 times a week and having patient annotate taking drug in a log which would be reviewed by clinic staff"
- Procedure: "treated"
- Condition: "tuberculosis"
- Temporal: "in the prior 2 years"
- Procedure: "PCR testing"
- Condition: "sensitivity"
- Drug: "rifamycin"
- Condition: "DST"
- Condition: "hypersensitivity"
- Drug: "rifampin"
- Drug: "rifabutin"
- Measurement: "Liver enzymes"
- Value: "greater than 2 times ULN"
- Measurement: "Bilirubin"
- Value: "greater than 2 times ULN"
- Measurement: "Serum creatinine"
- Value: "greater than 3 times ULN"
- Measurement: "Hemoglobin"
- Value: "less than 7.0 gms"
- Qualifier: "even if receiving erythropoietin"
- Measurement: "Absolute neutrophil count"
- Value: "less than 750 cells/mm3"
- Qualifier: "even if receiving G-CSF"
- Measurement: "Fasting triglycerides"
- Value: "greater than 400 mg/dL"
- Measurement: "Fasting cholesterol"
- Value: "> 1.6 upper limits of normal"
- Condition: "GI intolerance"
- Drug: "tuberculosis medications"
- Drug: "tuberculosis medications"
- Procedure: "discontinuation"
- Measurement: "Fasting glucose"
- Value: "greater 150 mg/dL"
- Condition: "Pregnant"
- Person: "women"
- Post-eligibility: "Use of one of the prohibited medications"
- Post-eligibility: "Any condition that the investigators feel could compromise the use of the current medication."
- Measurement: "CD4 cell count"
- Value: "50 cells/mm3or less"
- Condition: "Hepatitis B"
- Condition: "Hepatitis C"
- Observation: "Alcohol use"
- Observation: "illicit drug use"